Clinical trial exclusion criterion:
Patients with a history of stroke or an acute cardiovascular event over the previous 12 months.

Entity relations:
- Has_temporal("acute cardiovascular event", "over the previous 12 months")
- OR("stroke", "acute cardiovascular event")